Clinical trial inclusion criterion:
2) stroke within the past 6 to 60 months,

Entity relations:
- Has_temporal("stroke", "within the past 6 to 60 months")